Has a spectacle cylinder up to 0.75D in each eye.

The above is a clinical trial inclusion criterion. Annotated with entity spans:
Has a [Device: spectacle cylinder] [Value: up to 0.75D] in each eye.